Clinical trial exclusion criterion:
Any tobacco or nicotine product use in the past year

Entity relations:
- Has_temporal("tobacco", "past year")
- OR("tobacco", "nicotine product use")